What induces downstream of gene (DoG) readthrough transcription?

osmotic stress